Allergy to gabapentin, acetaminophen, codeine, or ibuprofen

The above is a clinical trial exclusion criterion. Annotated with entity spans:
[Condition: Allergy] to [Drug: gabapentin], [Drug: acetaminophen], [Drug: codeine], or [Drug: ibuprofen]